Hemophagocytic syndrome.

The above is a clinical trial exclusion criterion. Annotated with entity spans:
[Condition: Hemophagocytic syndrome].